目前治療慢性副鼻竇炎最常使用的手術為何？
A. Caldwell-Luc 手術
B. 功能性內視鏡鼻竇手術
C. 開窗術
D. 側鼻切開術

正確答案：B. 功能性內視鏡鼻竇手術